18-80 years old;

The above is a clinical trial inclusion criterion. Annotated with entity spans:
[Value: 18-80 years old];